Clinical trial exclusion criterion:
Patients were found to have arrhythmias or obtained QT wave elongation on electrocardiographic

Annotated entities:
- Condition: "arrhythmias"
- Condition: "QT wave elongation"
- Procedure: "electrocardiographic"